Clinical trial inclusion criterion:
A free consent

Annotated entities:
- Informed_consent: "A free consent"